臨床上使用的口服避孕劑主含 estrogen 與 progestin 兩種成分，服用後可減少濾泡刺激素（follicle-stimulating hormone; FSH）與黃體促素（luteinizing hormone; LH）的分泌而抑制卵巢濾泡成熟、阻斷排卵。下列敘述何者錯誤？
A. 避孕劑之兩種成分均屬於類固醇（steroid）荷爾蒙
B. 避孕劑能減少 FSH 與 LH 分泌，乃是透過對下視丘的正回饋調控
C. 避孕劑之兩種成分均可透過位於細胞核內之受體的作用調控特定基因的表現程度
D. 類固醇也有位於細胞膜上的受體負責快速的荷爾蒙效應

正確答案：B. 避孕劑能減少 FSH 與 LH 分泌，乃是透過對下視丘的正回饋調控